Clinical trial inclusion criterion:
Patients scheduled for supine-positioned elective craniotomy for supratentorial malignant and non-malignant brain tumors 3 cm or larger (measured as the largest diameter in any plane on MR images)

Annotated entities:
- Mood: "scheduled"
- Procedure: "supine-positioned elective craniotomy"
- Qualifier: "supratentorial"
- Qualifier: "malignant"
- Negation: "non"
- Qualifier: "malignant"
- Condition: "brain tumors"
- Qualifier: "3 cm or larger"
- Qualifier: "largest diameter in any plane"
- Procedure: "MR"